Clinical trial inclusion criterion:
type 2 diabetes

Annotated entities:
- Condition: "type 2 diabetes"